Adequate hepatic function:

The above is a clinical trial inclusion criterion. Annotated with entity spans:
[Parsing_Error: Adequate hepatic function:]